What is the function of mTOR?

The mTOR protein regulates assembly of the translation initiation machinery and are master regulators of cellular survival, growth and metabolism.